Clinical trial exclusion criterion:
Recent administration of any i.v. or s.c. anticoagulation within 12 hours, including unfractionated heparin, enoxaparin, and/or bivalirudin or current use of oral anticoagulation (i.e. warfarin or a NOACs)

Entity relations:
- Has_temporal("anticoagulation", "within 12 hours")
- Subsumes("oral anticoagulation", "warfarin")
- Subsumes("anticoagulation", "unfractionated heparin")
- OR("warfarin", "NOACs")
- OR("unfractionated heparin", "bivalirudin", "enoxaparin", "oral anticoagulation")